一位 49 歲男性舌癌病人接受手術。病理分期為 T4N2 的鱗狀上皮細胞癌。術後接受同步化學放射治療。6 個月後因左頸腫塊切片，證實為腫瘤復發。左頸腫塊迅速變大，潰瘍流膿。使用消炎止痛藥後三天，家屬發現患者很虛弱，幾乎都在半睡半醒狀態；於是帶病人至急診，身體檢查無其他異常。下列何者是最相關且必須的檢查？
A. 腦部電腦斷層檢查
B. 抽血驗 iPTH
C. 抽血驗 albumin
D. 抽血驗 calcium

正確答案：D. 抽血驗 calcium